Clinical trial exclusion criterion:
history of vertiginous disease; Ménière, Vertiginous migraine, atypical BPPV

Annotated entities:
- Condition: "vertiginous disease"
- Condition: "Ménière"
- Condition: "Vertiginous migraine"
- Condition: "atypical BPPV"